40歲男性病人，因急性雙眼視力降低、腹痛、嘔吐、腹瀉、頭痛、暈眩、全身虛弱、步態不穩等，被家人送至急診，有意識混亂、呼吸急促、以及視野縮小的情形。理學檢查及實 室檢查發現心跳加速、深肌腱反射增強、併有陰離子間隙（anion gap）增加及滲透間隙 （osmolar gap）上升之代謝性酸中毒、高血糖、白血球升高、低血鉀、低血鎂、急性腎衰竭等現象，眼底檢查出現視神經盤充血、視網膜水腫的情形。下列治療何者較不適當？
A. Fomepizole藥物
B. 透析（dialysis）
C. 乙醇（ethanol）
D. 類固醇（steroid）

正確答案：D. 類固醇（steroid）